胚胎發育第四週時，橫中隔（septum transversum）的位置是相對於下列何種體節（somite）之高度？
A. 枕節
B. 頸節
C. 胸節
D. 腰節

正確答案：B. 頸節